La evaluación psicológica informatizada o “evaluación asistida por ordenador”:
1. Se limita a la evaluación cualitativa.
2. Sustituye al psicólogo evaluador en su totalidad.
3. Analiza los resultados obtenidos, pero no sirve de control o de guía.
4. Sólo responde a algunos objetivos de la evaluación como es el ámbito cognitivo.
5. Pueden utilizarse tanto para la aplicación y corrección como para la interpretación de resultados.

Respuesta correcta: 5. Pueden utilizarse tanto para la aplicación y corrección como para la interpretación de resultados.